What are invasomes

Invasomes are novel vesicular systems that exhibit improved transdermal penetration compared to conventional liposomes.